有關肌肉組織的敘述，下列何者正確？
A. 心肌內的細絲（thin filaments）和中間絲（intermediate filaments）會附	至緻密體（dense body）
B. 平滑肌缺乏T-tubule，而是藉由小凹（caveolae）和小泡（vesicle）運輸鈣離子
C. 骨骼肌內的T-tubule是位在肌節（sarcomere）的M-line
D. 骨骼肌的細胞間接合處會形成閏盤（intercalated discs）

正確答案：B. 平滑肌缺乏T-tubule，而是藉由小凹（caveolae）和小泡（vesicle）運輸鈣離子